下列制酸劑（antacid）何者具有輕瀉作用？
A. Mg(OH)2
B. Al(OH)3
C. CaCO3
D. NaHCO3

正確答案：A. Mg(OH)2